Clinical trial inclusion criterion:
Age 18 or older.

Entity relations:
- Has_value("Age", "18 or older")